Clinical trial exclusion criterion:
BMI = 35 or weight < 50 kg

Annotated entities:
- Measurement: "BMI"
- Value: "= 35"
- Measurement: "weight"
- Value: "< 50 kg"